As of 2019, what type of cancer is commonly associated with ionizing radiation

Breast cancer, multiple myeloma, leukaemia and osteosarcoma are commonly associated with ionizing radiation.